Clinical trial inclusion criterion:
Have a total baseline score on the Brief Psychiatric Rating Scale (BPRS) = 45;

Entity relations:
- Subsumes("Brief Psychiatric Rating Scale", "BPRS")
- Has_value("Brief Psychiatric Rating Scale", "= 45")